Una mujer de 24 años, primigesta, sufre un aborto espontáneo a las 7 semanas de gestación. El estudio anatomopatológico de los restos abortivos indica enfermedad molar. Le debemos informar que:
1. El riesgo de una nueva gestación molar en un futuro embarazo es del 50%.
2. No debe quedar embarazada hasta realizar controles periódicos y haber pasado un año con niveles de beta-HCG negativos.
3. No es necesario realizar controles posteriores si la evacuación del tejido trofoblástico fue completa.
4. Es necesario que se realice controles periódicos ya que en el 40 % de los casos desarrollará una neoplasia trofoblástica gestacional.

Respuesta correcta: 2. No debe quedar embarazada hasta realizar controles periódicos y haber pasado un año con niveles de beta-HCG negativos.